下列何者會出現溶血性貧血（hemolytic anemia）、血小板低下與血液抹片出現碎裂紅血球 （schistocytes）？①栓塞性血小板低下紫斑（thrombotic thrombocytopenic purpura） ②巨大的血管瘤（hemangioma） ③瀰漫性血管內凝血（disseminated intravascular coagulation） ④免疫性血小板低下紫斑（immune thrombocytopenic purpura）
A. 僅①②
B. 僅①③
C. ①②③
D. ②③④

正確答案：C. ①②③